Presence of chronic HCV infection based on chart review will be defined as positive for anti-HCV antibody or HCV RNA at least 6 months before screening.

The above is a clinical trial inclusion criterion. Annotated with entity spans:
Presence of [Temporal: chronic] [Condition: HCV infection] based on chart review will be defined as [Value: positive] for [Measurement: anti-HCV antibody] or [Measurement: HCV RNA] [Temporal: at least 6 months before screening].